What is the nucleotide composition of the Lamin Associated Domains (LADs)?

Analysis of paralogs suggests that during evolution changes in A/T content have driven the relocation of genes to and from the nuclear lamina, in tight association with changes in expression level. Instead, cLADs are universally characterized by long stretches of DNA of high A/T content. Constitutive nuclear lamina-genome interactions are highly conserved and associated with A/T-rich sequence. This suggests that the A/T rule represents a default positioning mechanism that is locally overruled during lineage commitment. Cell-type specific LADs also tend to adhere to this "A/T rule" in embryonic stem cells, but not in differentiated cells.